Clinical trial exclusion criterion:
Patients with known brain metastases, unless these metastases have been treated and/or have been stable for at least six months prior to study start. Subjects with a history of brain metastases must have a head CT with contrast to document either response or progression.

Entity relations:
- Has_temporal("been stable for", "at least six months prior to study start")
- AND("history of", "brain metastases")
- AND("history of", "head CT with contrast")
- AND("brain metastases", "treated")
- Has_negation("treated", "unless")
- OR("treated", "been stable for")